Clinical trial exclusion criterion:
Patients with atrial fibrillation taking any anticoagulant therapy or patients with a history of cardioembolic ischemic stroke or hemorrhagic stroke.

Annotated entities:
- Condition: "atrial fibrillation"
- Procedure: "anticoagulant therapy"
- Temporal: "history of"
- Condition: "ischemic stroke"
- Qualifier: "cardioembolic"
- Condition: "hemorrhagic stroke"